Clinical trial inclusion criteria:
Clinical Administered PTSD Scale 5 Monthly version Criteria A and >30 points

Annotated entities:
- Measurement: "Clinical Administered PTSD Scale"
- Value: ">30 points"
- Value: "Criteria A"